Clinical trial exclusion criterion:
Subject has insulin-dependent diabetes mellitus.

Annotated entities:
- Qualifier: "insulin-dependent"
- Condition: "diabetes mellitus"